Aged 18 or over (up to the age of 35 which is the limit for the early intervention service)

The above is a clinical trial inclusion criterion. Annotated with entity spans:
[Person: Aged] [Value: 18 or over] ([Value: up to the age of 35] which is the limit for the early intervention service)